De las siguientes respuestas, cuál es la que mejor define a un paciente con microalbuminuria:
1. Presencia de enfermedad renal en estadío terminal.
2. Enfermedad nefrótica.
3. Predictivo de nefropatía diabética.
4. Glomerulonefritis.
5. Proteinura ortostática.

Respuesta correcta: 3. Predictivo de nefropatía diabética.